羊水過少（oligohydramnios）與下列何種胎兒之疾病或變化最不相關？
A. 腎未成形（renal agenesis）
B. 臀產式（breech presentation）
C. 腸閉鎖（intestinal atresia）
D. 肺發育不全（pulmonary hypoplasia）

正確答案：C. 腸閉鎖（intestinal atresia）